鼻及鼻竇疾病所謂的"Pott puffy tumor"指的是：
A. 額骨骨髓炎（frontal bone osteomyelitis）
B. 篩竇腫瘤（ethmoid tumor）
C. 眼眶骨膜下膿瘍（orbital subperiosteal abscess）
D. 鼻唇囊腫（nasolabial cyst）

正確答案：A. 額骨骨髓炎（frontal bone osteomyelitis）